Clinical trial inclusion criterion:
Mild male factor infertility or unexplained infertility.

Annotated entities:
- Qualifier: "Mild"
- Condition: "male factor infertility"
- Condition: "unexplained infertility"